Clinical trial exclusion criterion:
Creatinine >= 2 x upper limit of normal (ULN)

Entity relations:
- Has_value("Creatinine", ">= 2 x upper limit of normal (ULN)")